Patients with seizure disorders, known cardiovascular disease, or cerebrovascular disease.

The above is a clinical trial exclusion criterion. Annotated with entity spans:
Patients with [Condition: seizure disorders], known [Condition: cardiovascular disease], or [Condition: cerebrovascular disease].